Clinical trial exclusion criterion:
Contraindications to progestogens or oral contraceptive pills

Annotated entities:
- Condition: "Contraindications"
- Drug: "progestogens"
- Drug: "oral contraceptive pills"